Clinical trial inclusion criterion:
Treated with either diet alone, any combination of oral antidiabetic agents, non-insulin injectables or insulin therapy

Entity relations:
- OR("diet", "non-insulin injectables therapy", "insulin", "oral antidiabetic agents")